下列有關硬蜱（hard tick）的敘述何者正確？
A. 雌蜱背板佔據整個背部
B. 成蟲一生只產一次卵
C. 稚蟲期（nymph）可分為三到七個時期
D. 成蟲期在宿主身上可重覆多次吸血

正確答案：B. 成蟲一生只產一次卵